Clinical trial inclusion criterion:
Patients must be registered in a social security system or with a health insurance coverage

Annotated entities:
- Observation: "registered in a social security system"
- Observation: "health insurance coverage"
- Non-query-able: "health insurance coverage"
- Non-query-able: "registered in a social security system"